Clinical trial inclusion criterion:
Undergoing ECT for treatment of their symptoms

Annotated entities:
- Procedure: "ECT"
- Temporal: "Undergoing"